Submucous myoma.

The above is a clinical trial exclusion criterion. Annotated with entity spans:
[Condition: Submucous myoma].